Clinical trial inclusion criterion:
Age of at least 18 years

Entity relations:
- Has_value("Age", "at least 18 years")